Clinical trial exclusion criterion:
Other protocol defined exclusion criteria could apply.

Annotated entities:
- Non-representable: "Other protocol defined exclusion criteria could apply."